穿孔型微血管（fenestrated capillaries）出現於下列何者？
A. 肌肉
B. 肺
C. 膽囊
D. 大腦皮質

正確答案：C. 膽囊